一位女性病患素食多年，患有惡性貧血（pernicious anemia），判斷她有某種含金屬離子的水溶性維生素缺乏症。關於此維生素的特性，下列敘述何者正確？
A. 此維生素須含有氰基，方能直接參與酵素反應形態
B. 此維生素須含有一鐵離子才帶有活性
C. 此維生素含有鈷離子
D. 小腸壁的細胞會分泌一種結合蛋白質，促進此維生素的吸收

正確答案：C. 此維生素含有鈷離子